have a history of solid organ or bone marrow transplant

The above is a clinical trial exclusion criterion. Annotated with entity spans:
have a [Qualifier: history] of [Procedure: solid organ] or [Procedure: bone marrow transplant]